禽流感（Avian influenza）有兩種型式，其中一種是高病原性禽流感，可引起高死亡率，目前 A 型病毒之那二種亞型可引起高病原性禽流感？
A. H5 和 H7
B. H1 和 H3
C. H6 和 H8
D. H2 和 H4

正確答案：A. H5 和 H7